Clinical trial inclusion criteria:
self-reported healthy adults between the ages of 18-60 who are fluent in English.

Annotated entities:
- Condition: "healthy"
- Person: "adults"
- Person: "ages"
- Value: "between 18-60"
- Observation: "fluent in English"
- Qualifier: "self-reported"